Clinical trial exclusion criterion:
Planned revascularization within 6 months

Annotated entities:
- Procedure: "revascularization"
- Temporal: "within 6 months"
- Mood: "Planned"